Clinical trial exclusion criterion:
Blood pressure averaging > 159/99 mmHg

Annotated entities:
- Measurement: "Blood pressure"
- Value: "> 159/99 mmHg"